有關眼球睫狀體（ciliary body），下列敘述何項錯誤？
A. 睫狀體位於虹膜（iris）與脈絡膜（choroids）之間
B. 睫狀肌（ciliary muscle）由骨骼肌所構成
C. 睫狀體上皮（ciliary epithelium）可以分泌水樣液（aqueous humor）
D. 水狀液由史萊姆氏管（canal of Schlemm）回收

正確答案：B. 睫狀肌（ciliary muscle）由骨骼肌所構成